甲狀腺髓質癌（medullary carcinoma），何者錯誤？
A. 宜作甲狀腺全切除合併中央隔間淋巴結切除（central compartment dissection）
B. 診斷用CEA、calcitonin及細胞學檢查
C. 伴有嗜鉻細胞癌（pheochromocytoma）病人時，要先進行甲狀腺髓質癌手術
D. 碘131治療無效

正確答案：C. 伴有嗜鉻細胞癌（pheochromocytoma）病人時，要先進行甲狀腺髓質癌手術